Clinical trial exclusion criterion:
Age of＜18y or＞75y

Entity relations:
- Has_value("Age", "＜18y or＞75y")